Written informed consent obtained from the subject.

The above is a clinical trial inclusion criterion. Annotated with entity spans:
[Observation: Written informed consent] obtained from the subject.